Clinical trial exclusion criterion:
The patients have allergic history or contraindication of tamoxifen.

Annotated entities:
- Condition: "allergic"
- Drug: "tamoxifen"
- Condition: "contraindication"